What doses of fingolimod were administered during the FREEDOMS trial?

In the FREEDOMS trial fingolimod was administered at 0.5mg or 1.25mg doses.